移除骨骼肌細胞質液（cytosol）內的鈣離子，會產生下列何種現象？
A. 肌動蛋白（actin）上的肌凝蛋白（myosin）連接處，經旋轉肌凝蛋白（tropomyosin）作用而暴露出來
B. 旋轉肌凝蛋白會改變形態，使得旋轉子（troponin）從連接橋（cross-bridge）結合處離開
C. 旋轉子會改變形態，使得連接橋結合處暴露出來
D. 肌動蛋白上的肌凝蛋白連接處，被旋轉肌凝蛋白占據

正確答案：D. 肌動蛋白上的肌凝蛋白連接處，被旋轉肌凝蛋白占據